Clinical trial exclusion criterion:
11. Systolic blood pressure <85 or diastolic blood pressure <55

Entity relations:
- Has_value("diastolic blood pressure", "<55")
- Has_value("Systolic blood pressure", "<85")
- OR("Systolic blood pressure", "diastolic blood pressure")